Clinical trial exclusion criterion:
14. Mental impairment that may compromise compliance with the requirements of the study.

Annotated entities:
- Parsing_Error: "14."
- Condition: "Mental impairment"
- Observation: "compromise compliance"
- Context_Error: "Mental impairment that may compromise compliance with the requirements of the study."